Clinical trial exclusion criterion:
(1) Uterine abnormalities (e.g. septate, bicornuate and fibroid uterus, Asherman Syndrome).

Entity relations:
- AND("Uterine abnormalities", "septate uterus")
- OR("septate uterus", "bicornuate uterus", "fibroid uterus", "Asherman Syndrome")